Clinical trial exclusion criterion:
Other invasive malignancies within 5 years prior to Day 1

Annotated entities:
- Qualifier: "Other"
- Condition: "invasive malignancies"
- Temporal: "within 5 years prior to Day 1"
- Reference_point: "Day 1"